Una embarazada de 10 semanas de gestación, acude a urgencias hospitalarias por presentar una presión arterial de 160/105 mmHg. Buen estado general, solo leve cefalea, motivo por el que se tomó la presión arterial. Tras 4 horas de reposo presenta cifras de 150/95 mmHg. Se le realiza un hemograma que es normal y una proteinuria que es negativa. ¿Qué tipo de hipertensión presenta?
1. Preeclampsia moderada.
2. Hipertensión inducida por el embarazo.
3. Hipertensión crónica.
4. Eclampsia.

Respuesta correcta: 3. Hipertensión crónica.